Clinical trial exclusion criterion:
Subjects were not to have donated plasma within 90 days prior to study initiation.

Entity relations:
- Has_index("within 90 days prior to study initiation", "study initiation")
- Has_negation("donated plasma", "not")
- Has_temporal("donated plasma", "within 90 days prior to study initiation")